Clinical trial exclusion criterion:
Patients receiving therapeutic heparin medication due to chronic coagulation disease / anticoagulation medication (i.e. partial thromboplastin time > 60 sec)

Entity relations:
- Has_value("partial thromboplastin time", "> 60 sec")
- AND("heparin", "chronic coagulation disease")
- OR("chronic coagulation disease", "anticoagulation medication")